¿Qué trastorno se asocia a amenazas, gestos o conductas suicidas recurrentes o comportamientos de automutilación?:
1. Trastorno de personalidad esquizoide.
2. Trastorno de personalidad pasivo-agresivo.
3. Trastorno de personalidad límite.
4. Trastorno de personalidad antisocial.

Respuesta correcta: 3. Trastorno de personalidad límite.